Which heat shock protein is found to be upregulated during Hsp90 inhibition?

HSP90 inhibition was found to be associated with induction of HSP70 expression.